胎兒若有腹裂（gastroschisis）之先天性畸形，其染色體為何？
A. 最常合併唐氏症
B. 最常合併 trisomy 18
C. 最常合併 trisomy 13
D. 很少合併染色體異常

正確答案：D. 很少合併染色體異常